Clinical trial exclusion criteria:
recurrent contracture in the finger to be treated
neurologic condition causing the loss of function of the finger to be treated
contraindication for collagenase clostridium histolyticym (Xiapex/Xiaflex ®)
pregnant or breast feeding
TPED > 135° (Tubiana stage 4) in finger to be treated
rheumatoid arthritis
previous fracture in finger to be treated, which affects range of motion of MP or PIP joint
age > 80 years

Annotated entities:
- Condition: "contracture"
- Qualifier: "finger to be treated"
- Qualifier: "recurrent"
- Condition: "neurologic condition"
- Condition: "loss of function"
- Qualifier: "finger to be treated"
- Condition: "contraindication"
- Drug: "collagenase clostridium histolyticym"
- Drug: "Xiapex"
- Drug: "Xiaflex"
- Condition: "pregnant"
- Observation: "breast feeding"
- Measurement: "TPED"
- Value: "> 135°"
- Measurement: "Tubiana"
- Value: "stage 4"
- Qualifier: "finger to be treated"
- Condition: "rheumatoid arthritis"
- Qualifier: "finger to be treated"
- Condition: "fracture"
- Temporal: "previous"
- Condition: "affects range of motion"
- Qualifier: "MP joint"
- Qualifier: "PIP joint"
- Person: "age"
- Value: "> 80 years"